Si la pO2 arterial disminuye a 60 mm de Hg:
1. Disminuye la ventilación.
2. Se activan los quimiorreceptores centrales.
3. Se deprimen los quimiorreceptores centrales.
4. Se activan los quimiorreceptores arteriales.
5. Produce pérdida de consciencia.

Respuesta correcta: 4. Se activan los quimiorreceptores arteriales.